有關卵巢動脈（ovarian artery）的敘述，下列何者正確？
A. 為髂內動脈（internal iliac artery）的分支
B. 經由卵巢韌帶（ovarian ligament）進入卵巢
C. 從髂外動脈（external iliac artery）的後方進入骨盆腔
D. 經由懸韌帶（suspensory ligament of ovary）進入卵巢

正確答案：D. 經由懸韌帶（suspensory ligament of ovary）進入卵巢